在嬰幼兒時感染下列何種病毒，於年長時會造成腦炎，其症狀是癡呆、智力退化、甚至死亡，此症狀稱亞急性硬化泛腦炎（subacute sclerosing panencephalitis）？
A. 感冒病毒
B. 腮腺炎病毒
C. 麻疹病毒
D. 小兒麻痺症病毒

正確答案：C. 麻疹病毒